下列有關腦性麻痺的敘述，何者錯誤？
A. 懷孕週數小於 32 週及出生體重小於 2500 公克是腦性麻痺的危險因子
B. 腦性麻痺是腦部退化性疾病引起
C. 造成腦性麻痺的原因可依時間區分為產前、產中、產後的致病因
D. 造成的症狀必須包括運動功能障礙

正確答案：B. 腦性麻痺是腦部退化性疾病引起